一位男性廚師二年前開始出現反覆檢查水龍頭及馬桶是否漏水，又時常盯著指縫，看是否有指垢，每天為此耗去大量時間。半年後出現在家要用油煎雙手的重複念頭，因而怕見油鍋。家人勸其就醫，其卻不予理會。近一個月聲稱聽見對面大樓有一女子向他表示情愛，但過幾天又稱那女子罵他流氓，要叫人來教訓他，為此惶惶不安，有時喃喃自語，故由家屬陪來就診。該病患目前最可能的診斷是：
A. 廣泛性焦慮症（generalized anxiety disorder）
B. 雙極性疾患（bipolar disorder）
C. 社交焦慮症（social anxiety disorder）
D. 精神分裂症（schizophrenic disorder）

正確答案：D. 精神分裂症（schizophrenic disorder）